Clinical trial exclusion criterion:
Age > 18 Years

Annotated entities:
- Person: "Age"
- Value: "> 18 Years"